Clinical trial exclusion criterion:
HIV infected participants who are on anti-retroviral drugs

Entity relations:
- AND("HIV infected", "anti-retroviral drugs")